通常自來水淨水處理之流程，下列排序何者正確？
A. 沉澱、凝集、過濾、消毒
B. 凝集、沉澱、過濾、消毒
C. 凝集、過濾、沉澱、消毒
D. 沉澱、過濾、凝集、消毒

正確答案：B. 凝集、沉澱、過濾、消毒